關於失智症的描述，何者正確？
A. 會產生記憶障礙，但不至於呈現人格改變
B. 最常見的是血管性失智
C. 正常老化的認知功能衰退也會顯著影響社交行為
D. 處置上首先是確診，確定是否為可逆性之失智症

正確答案：D. 處置上首先是確診，確定是否為可逆性之失智症